Clinical trial exclusion criterion:
severe hepatic or renal dysfunction;

Entity relations:
- Has_qualifier("hepatic dysfunction", "severe")
- OR("hepatic dysfunction", "renal dysfunction")